Clinical trial inclusion criterion:
2. Patients who have received prior adjuvant therapy for early-stage lung cancer are eligible if at least 12 months have elapsed from that treatment.

Entity relations:
- causal("early-stage lung cancer", "adjuvant therapy")
- multi("at least 12 months have elapsed from that treatment", "that treatment")
- multi("that treatment", "treatment")
- AND("early-stage lung cancer", "treatment")